頸外動脈（external carotid artery）的分枝不供應血液給：
A. 硬腦膜
B. 鼻黏膜
C. 上、下齒槽
D. 眼球

正確答案：D. 眼球